Treatment naïve or treatment experienced (Peg-RBV or triple therapy).

The above is a clinical trial inclusion criterion. Annotated with entity spans:
[Condition: Treatment naïve] or [Condition: treatment experienced] ([Procedure: Peg-RBV] or [Procedure: triple therapy]).